下列有關房水（aqueous humour）的敘述，何者錯誤？
A. 充滿眼前房及眼後房，體積大約為250 µL
B. 形成速度大約為2.5 µL/min
C. 滲透壓（osmotic pressure）稍低於血漿（plasma）的滲透壓
D. 成分與血漿類似，但是抗壞血酸（ascorbate），丙酮酸鹽（pyruvate）及乳酸鹽（lactate）之濃度比血漿高

正確答案：C. 滲透壓（osmotic pressure）稍低於血漿（plasma）的滲透壓